Clinical trial exclusion criterion:
3. History of oxygen dependence;

Entity relations:
- Has_temporal("oxygen dependence", "History")